Primary groups: Vaccination against typhoid fever within 5 years before dosing.

The above is a clinical trial exclusion criterion. Annotated with entity spans:
[Observation: Primary groups]: [Procedure: Vaccination against typhoid fever] [Temporal: within 5 years before dosing].